La heredabilidad de un rasgo de personalidad:
1. Es un concepto estadístico para estimar la influencia de los fenotipos sobre los genotipos, independientemente del ambiente.
2. Es generalizable para todos los humanos, independientemente de la cultura y el momento histórico.
3. Pone en duda la capacidad del ambiente para modificar la dotación genética.
4. Se estudia, entre otras perspectivas, desde la genética molecular.
5. Se refiere a la influencia directa de los genes paternos y maternos en la conducta de un individuo.

Respuesta correcta: 4. Se estudia, entre otras perspectivas, desde la genética molecular.